Karnofsky/Lansky score 50 or greater

The above is a clinical trial inclusion criterion. Annotated with entity spans:
[Measurement: Karnofsky/Lansky] [Value: score 50 or greater]